Clinical trial inclusion criterion:
Normal motor and cognitive development up to time of injury

Annotated entities:
- Measurement: "cognitive development"
- Value: "Normal"
- Measurement: "motor development"
- Temporal: "up to time of injury"
- Reference_point: "time of injury"